Clinical trial inclusion criterion:
Type 2 diabetic patients

Annotated entities:
- Condition: "Type 2 diabetic"